Clinical trial exclusion criterion:
Hormone treatment within the last 2 months

Entity relations:
- multi("Hormone treatment", "Hormone")
- Has_temporal("Hormone treatment", "within the last 2 months")